Clinical trial inclusion criterion:
systolic blood pressure between 140-160 mmHG

Entity relations:
- Has_value("systolic blood pressure", "between 140-160 mmHG")